下列何者與細胞周期 G2/M transition 的調控關係（modulation）最低？
A. cyclin D
B. CDK 1
C. CDK 2
D. cyclin B

正確答案：A. cyclin D